Age less than 14 years

The above is a clinical trial exclusion criterion. Annotated with entity spans:
[Person: Age] [Value: less than 14 years]